32歲男病人罹患活動性C型病毒肝炎已數年。最近數星期，兩下肢皮膚出現許多有壓痛之小紅疹。且四肢麻木疼痛。檢查發現有輕度蛋白尿。下列那一項檢查陽性最具診斷價值？
A. 類風濕因子（RF）
B. 抗細胞核抗體（ANA）
C. 冷凝球蛋白（cryoglobulin）
D. C型肝炎病毒量（viral load）

正確答案：C. 冷凝球蛋白（cryoglobulin）